Clinical trial inclusion criterion:
=18 years old males

Entity relations:
- Has_value("years", "=18 years old")